Clinical trial exclusion criterion:
Body mass index (BMI) > 34

Entity relations:
- Subsumes("Body mass index", "BMI")
- Has_value("Body mass index", "> 34")